Clinical trial exclusion criterion:
History of any use of citalopram or escitalopram during the current episode or need for drugs that may interact with these agents, i.e. drug metabolized by the 2D6 P450 isoenzyme system;

Entity relations:
- Has_qualifier("episode", "current")
- AND("citalopram", "episode")
- AND("drugs", "agents")
- OR("citalopram", "escitalopram")